Clinical trial exclusion criterion:
Unstable cardiovascular disease with hospitalization within 1 year for acute coronary syndrome

Annotated entities:
- Visit: "hospitalization"
- Temporal: "within 1 year"
- Condition: "acute coronary syndrome"